major illness or congenital anomaly

The above is a clinical trial exclusion criterion. Annotated with entity spans:
[Condition: major illness] or [Condition: congenital anomaly]